Clinical trial exclusion criterion:
Systemic or ocular medications that may confound the outcome of the intervention

Entity relations:
- Has_qualifier("Systemic medications", "may confound the outcome of the intervention")
- OR("Systemic medications", "ocular medications")